Documented allergy to local anesthetic

The above is a clinical trial exclusion criterion. Annotated with entity spans:
Documented [Condition: allergy] to [Drug: local anesthetic]